Clinical trial exclusion criterion:
Prior systemic therapy targeting PD-1: PD-L1 axis.

Annotated entities:
- Procedure: "systemic therapy targeting PD-1: PD-L1 axis"